Clinical trial inclusion criterion:
Patients with non-psychotic comorbid conditions may be included.

Annotated entities:
- Condition: "non-psychotic conditions"